Clinical trial exclusion criteria:
hypoglycemia SE;psychogenic SE;any other pseudo-SE

Annotated entities:
- Condition: "hypoglycemia SE"
- Condition: "psychogenic SE"
- Condition: "pseudo-SE"